Clinical trial exclusion criterion:
active infection

Entity relations:
- Has_qualifier("infection", "active")